Which one of the CYP450 enzymes is the second most frequently implicated in the metabolism of the drugs currently available on the market?

CYP3A4 and CYP2D6 are the most relevant since they metabolize about 50% and 30% of the drugs on the market, respectively.